History of ventricular tachycardia within 3 months before study entry; second- or third-degree atrioventricular block.

The above is a clinical trial exclusion criterion. Annotated with entity spans:
History of [Condition: ventricular tachycardia] [Temporal: within 3 months] before study entry; [Condition: second-] or [Condition: third-degree atrioventricular block].